Patients who will require magnetic resonance imaging (MRI)

The above is a clinical trial exclusion criterion. Annotated with entity spans:
Patients who will require [Procedure: magnetic resonance imaging] ([Procedure: MRI])